Clinical trial inclusion criterion:
Age between one year and 18 years

Entity relations:
- Has_value("Age", "between one year and 18 years")